Clinical trial exclusion criterion:
Spondylolisthesis Grade II or higher.

Entity relations:
- Has_value("Grade", "II or higher")
- AND("Spondylolisthesis", "Grade")